3天大的陳小弟因為一種很少見的先天性疾病（Pierre-Robin Syndrome）住在嬰兒室，你必須為他照相以在討論會中使用，但是陳家正處於產下畸形兒的傷痛中，下列何種處理方式是最好的？
A. 照相不會傷害病人，不需家屬同意
B. 須取得家屬同意才能照相
C. 討論案例時在顯示病人照片時遮蓋其眼睛，使他人無法辨認，不需家屬同意
D. 向人體試	委員會申請照相

正確答案：B. 須取得家屬同意才能照相